Clinical trial inclusion criterion:
aged 30 to 85 years;

Annotated entities:
- Person: "aged"
- Value: "30 to 85 years"